Is single guide RNA part of the CRISPR/Cas9 tool or an inhibitor of its function?

Single guide RNA is part of the CRISPR/Cas9 system.